下列有關痢疾阿米巴（Entamoeba histolytica）的敘述中，何者正確？
A. 阿米巴肝膿瘍（amebic liver abscess）常發生在左葉肝臟
B. 在膿瘍的中央採檢體，檢出其滋養體 （trophozoites）的機會比較大
C. 阿米巴肝膿瘍（amebic liver abscess）的第一線用藥為mebendazole
D. 阿米巴腫（ameboma）常易被誤診為惡性腫瘤

正確答案：D. 阿米巴腫（ameboma）常易被誤診為惡性腫瘤